下列真菌疾病中，那些是兩型性真菌（Dimorphic fungi）？
A. Aspergillus niger and Rhizopus stolonifer
B. Candida albicans and Rhizopus stolonifer
C. Sporothrix schenckii and Candida albicans
D. Sporothrix schenckii and Penicillium marneffei

正確答案：D. Sporothrix schenckii and Penicillium marneffei